Clinical trial exclusion criterion:
Known hemoglobin <10 g/dL

Annotated entities:
- Measurement: "hemoglobin"
- Value: "<10 g/dL"